Clinical trial exclusion criterion:
Malignancy within 5 years before Screening

Entity relations:
- Has_index("within 5 years before Screening", "Screening")
- Has_temporal("Malignancy", "within 5 years before Screening")